Clinical trial exclusion criterion:
Are undergoing an acute withdrawal syndrome from drugs or alcohol.

Entity relations:
- AND("acute withdrawal syndrome", "drugs")
- OR("drugs", "alcohol")